Clinical trial exclusion criterion:
baseline systolic blood pressure (SBP) < 100 mmHg

Annotated entities:
- Temporal: "baseline"
- Measurement: "systolic blood pressure"
- Measurement: "SBP"
- Value: "< 100 mmHg"